Clinical trial exclusion criterion:
Cirrhosis, chronic active hepatitis or chronic persistent hepatitis

Annotated entities:
- Condition: "Cirrhosis"
- Condition: "chronic active hepatitis"
- Condition: "chronic persistent hepatitis"